La piruvato deshidrogenasa:
1. Cataliza una descarboxilación oxidativa.
2. Es una enzima monomérica de baja masa molecular.
3. Se localiza en el citoplasma.
4. Cataliza la producción de etanol.
5. Consume ATP.

Respuesta correcta: 1. Cataliza una descarboxilación oxidativa.